有關乳癌荷爾蒙治療，下列敘述何者最不正確？
A. 大約 50-60% 的停經前乳癌和 60-75% 的停經後乳癌有動情素接受體（ER）或黃體素接受體（PR）
B. 抗荷爾蒙治療包括 GnRH agonist、抗動情素、aromatase inhibitor 和 progestin 類的 megestrol acetate 等
C. 停經前的婦女轉移性乳癌之荷爾蒙治療，GnRH agonist 合併 tamoxifen 理論上效果比單用 GnRH
D. 對於停經後的婦女，目前轉移性乳癌的抗荷爾蒙治療之第一線藥是 tamoxifen

正確答案：D. 對於停經後的婦女，目前轉移性乳癌的抗荷爾蒙治療之第一線藥是 tamoxifen